Las moléculas transportadoras de electrones:
1. Son coenzimas de naturaleza nucleotídica.
2. Intercambian electrones en reacciones de oxidación-reducción.
3. Son moléculas capaces de oxidarse y reducirse.
4. El FAD (dinucleótido de flavina y adenina) y el FMN (mononucleótidos de flavina) son moléculas transportadoras de electrones.
5. Todas son ciertas.

Respuesta correcta: 5. Todas son ciertas.